Household members of children in Group A

The above is a clinical trial exclusion criterion. Annotated with entity spans:
[Person: Household members] of [Person: children] in [Person: Group A]